Brain trauma or neurosurgery;

The above is a clinical trial exclusion criterion. Annotated with entity spans:
[Condition: Brain trauma] or [Procedure: neurosurgery];